Clinical trial exclusion criteria:
HIV infection at screening
participation in previous or concurrent HIV vaccine trials
lactating, pregnant or planning pregnancy
renal function impairment (serum creatinine >1.5 mg/dl), Fanconi syndrome
abnormal liver function tests (AST/ALT > 43 U/L), liver disease, viral hepatitis, hepatitis B virus (HBV) infection
serum phosphorus <2.2mg/dl, osteoporosis
known sensitivity to components of the Truvada® formulation
any immunosuppressive treatment, such as systemic corticosteroids
assumption of medication that interacts with Truvada®
high likelihood of poor adherence to PREP and clinic attendance
any condition that in the opinion of the attending physician could endanger the health of the participant or render her unsuitable to participate in the trial

Annotated entities:
- Condition: "HIV infection"
- Competing_trial: "participation in previous or concurrent HIV vaccine trials"
- Pregnancy_considerations: "actating, pregnant or planning pregnancy"
- Condition: "renal function impairment"
- Measurement: "serum creatinine"
- Value: ">1.5 mg/dl"
- Condition: "Fanconi syndrome"
- Measurement: "liver function tests"
- Value: "abnormal"
- Measurement: "AST"
- Measurement: "ALT"
- Value: "> 43 U/L"
- Condition: "liver disease"
- Condition: "viral hepatitis"
- Condition: "hepatitis B virus (HBV) infection"
- Measurement: "serum phosphorus"
- Value: "<2.2mg/dl"
- Condition: "osteoporosis"
- Condition: "sensitivity"
- Drug: "Truvada"
- Procedure: "immunosuppressive treatment"
- Drug: "systemic corticosteroids"
- Non-query-able: "assumption of medication that interacts with Truvada"
- Post-eligibility: "high likelihood of poor adherence to PREP and clinic attendanc"
- Non-query-able: "any condition that in the opinion of the attending physician could endanger the health of the participant or render her unsuitable to participate in the trial"